Clinical trial exclusion criterion:
Unlikely to survive 90 days

Annotated entities:
- Non-representable: "Unlikely to survive 90 days"